綠膿桿菌（Pseudomonas aeruginosa）所產生的外毒素 A（exotoxin A）對細胞的毒性作用機制與下列何者相似？
A. 霍亂毒素（Cholera toxin）
B. 白喉毒素（Diphtheria toxin）
C. 破傷風毒素（Tetanospasmin）
D. 鏈球菌熱源外毒素（Pyrogenic exotoxin）

正確答案：B. 白喉毒素（Diphtheria toxin）